Clinical trial inclusion criteria:
Male and female Active-duty SMs or Veterans aged 18 or older who are in good general health.
History of blast and/or impact head trauma mTBI meeting Defense and Veterans Brain Injury Center (DVBIC) mTBI criteria, which define mTBI as an injury to the head causing at least one of the following: alteration in consciousness (for up to 24 hours after the injury), loss of consciousness 0-30 minutes, and/or post-traumatic amnesia up to 1 day post-injury. If available, the Glasgow Coma Scale score must be 13-15, and head imaging findings (if imaging was performed) must be negative.
Frequent HAs that started within 3months after a head injury. The HAs either 1) must last 4 or more hours a day and reach a moderate to severe intensity at any point during the headache, or 2) may be of any severity or duration if the participant takes a triptan or ergotamine. HAs meeting these criteria must have been present on average at least 8 days per 4-week period, starting within 30 days after head injury and occurring by self-report for at least 3 months prior to the Initial Screening Visit. The 4-week HA frequency/severity criteria must be confirmed during the Preliminary Screening Period.
Women of childbearing potential must agree to abstain from sexual relations that could result in pregnancy or use an effective method of birth control acceptable to both participant and the clinician prescriber during the study. Men are not required to use contraception during the study.
Participants must have English fluency sufficient to complete study measures.

Annotated entities:
- Person: "Male"
- Person: "female"
- Person: "Active-duty SMs"
- Person: "Veterans"
- Value: "18 or older"
- Person: "aged"
- Condition: "good general health"
- Observation: "blast"
- Temporal: "History of"
- Condition: "impact head trauma"
- Measurement: "Defense and Veterans Brain Injury Center (DVBIC) mTBI criteria"
- Value: "meeting"
- Condition: "alteration in consciousness"
- Temporal: "for up to 24 hours after the injury"
- Reference_point: "the injury"
- Condition: "loss of consciousness"
- Temporal: "0-30 minutes"
- Condition: "post-traumatic amnesia"
- Temporal: "up to 1 day post-injury"
- Measurement: "Glasgow Coma Scale"
- Value: "13-15"
- Procedure: "head imaging"
- Condition: "findings"
- Negation: "negative"
- Condition: "HAs"
- Qualifier: "Frequent"
- Temporal: "within 3months after a head injury"
- Reference_point: "a head injury"
- Condition: "HAs"
- Multiplier: "last 4 or more hours a day"
- Qualifier: "moderate to severe intensity"
- Drug: "triptan"
- Drug: "ergotamine"
- Multiplier: "at least 8 days per 4-week period"
- Temporal: "within 30 days after head injury"
- Temporal: "at least 3 months prior to the Initial Screening Visit"
- Reference_point: "the Initial Screening Visit"
- Pregnancy_considerations: "Women of childbearing potential must agree to abstain from sexual relations that could result in pregnancy or use an effective method of birth control acceptable to both participant and the clinician prescriber during the study. Men are not required to use contraception during the study."
- Non-query-able: "articipants must have English fluency sufficient to complete study measures"